和血液中鈣離子濃度調節有關的細胞是：
A. 松果腺主細胞（pinealocytes）
B. 甲狀腺濾泡細胞（thyroid follicular cells）
C. 腎上腺嗜鉻細胞（chromaffin cells）
D. 副甲狀腺主細胞（chief cells of parathyroid gland）

正確答案：D. 副甲狀腺主細胞（chief cells of parathyroid gland）